有關幽門桿菌性胃炎的敘述，下列何者最不適當？
A. 在竇部（antrum）比體部（body）嚴重
B. 感染帶有CagA基因的細菌者，比較會產生胃癌
C. 細菌較易出現在腸道化生（intestinal metaplasia）的部位
D. 是胃淋巴瘤的主要成因

正確答案：C. 細菌較易出現在腸道化生（intestinal metaplasia）的部位